Clinical trial exclusion criterion:
Massive hemoptysis defined as > 250 cc in a 24 hour period or 100 cc/day over 4 consecutive days occurring in the two weeks prior to Visit 2

Entity relations:
- Has_index("in the two weeks prior to Visit 2", "Visit 2")
- Has_qualifier("hemoptysis", "Massive")
- Has_multiplier("hemoptysis", "> 250 cc")
- Has_temporal("hemoptysis", "in the two weeks prior to Visit 2")
- Has_temporal("hemoptysis", "in a 24 hour period")
- Has_temporal("hemoptysis", "over 4 consecutive days")
- OR("> 250 cc", "100 cc/day")